情感性疾患中所謂的遮蔽型鬱症（masked depression），最多發生在下列何者？
A. 青少年
B. 成年人
C. 老年人
D. 兒童

正確答案：C. 老年人